依據 2008 年版赫爾辛基宣言（Declaration of Helsinki），在一般人的人體研究中，每一個可能的受試者，必須被告知的內容，下列何者錯誤？
A. 該研究的目的、方法及研究人員所屬機構
B. 該研究可預見的益處及可能伴隨的危險與不適
C. 受試者擁有的權利，包括可拒絕參與研究，或可隨時撤回同意而不受報復
D. 研究的經費來源因易引起誤會，不需告知受試者

正確答案：D. 研究的經費來源因易引起誤會，不需告知受試者